支配骨骼肌之α運動神經元（motor neuron）位於何處？
A. ventral horn of the spinal cord
B. primary motor cortex
C. basal ganglia
D. pyramidal tract

正確答案：A. ventral horn of the spinal cord